20-40 years old women

The above is a clinical trial inclusion criterion. Annotated with entity spans:
[Value: 20-40 years] [Person: old] [Person: women]